Característicamente los aminoácidos glucogénicos:
1. Pueden producir acetil-coenzima A.
2. Son intermediarios del ciclo de la urea.
3. Podrán contribuir a la síntesis de glucosa.
4. Son el sustrato de reacciones catalizadas por transaldolasas.

Respuesta correcta: 3. Podrán contribuir a la síntesis de glucosa.